Clinical trial inclusion criterion:
Alkaline phosphatase: ≤ 2.5 x ULN

Entity relations:
- Has_value("Alkaline phosphatase", "≤ 2.5 x ULN")